Clinical trial exclusion criterion:
contraindications to neuraxial anesthesia or require general anesthesia for CD

Entity relations:
- AND("general anesthesia", "CD")
- Has_mood("general anesthesia", "require")
- AND("contraindications", "neuraxial anesthesia")
- OR("contraindications", "general anesthesia")